頸外動脈（external carotid artery）與其分枝不供應血液給：
A. 腦部
B. 硬腦膜
C. 眼眶
D. 鼻腔黏膜

正確答案：A. 腦部